Clinical trial inclusion criterion:
Life expectancy greater than or equal to 6 months

Annotated entities:
- Observation: "Life expectancy"
- Value: "equal to 6 months"
- Value: "greater than 6 months"